Clinical trial inclusion criterion:
Primary kidney transplant recipients, adults

Annotated entities:
- Procedure: "kidney transplant"
- Qualifier: "Primary"
- Person: "adults"